Acude a su consulta un hombre de 80 años de edad para valoración de una colecistectomía programa por laparoscopia. Presenta antecedentes de hipertensión arterial en tratamiento desde hace 10 años. Niega enfermedad cardiaca ni pulmonar. No presenta dolor torácico. Tiene una vida activa y diariamente acude al gimnasio en donde alterna natación y caminar por la cinta al menos una hora. Tratamiento habitual: nebivolol 5 mg cada 24 horas e hidroclorotiazida 12,5 mg al día. Exploración física: peso 73 kgs; talla 179 cms; presión arterial 138/80 mmHg; frecuencia cardiaca 60 latidos/minuto. No se auscultan soplos. ¿Cuál de los siguientes es el planteamiento preoperatorio más adecuado?
1. Realizar una prueba de esfuerzo.
2. Realizar una ecocardiografía.
3. Realizar una gammagrafía con talio y dipiridamol.
4. Realizar electrocardiograma.

Respuesta correcta: 4. Realizar electrocardiograma.